Patients with orthopedic or neuromuscular disorders that preclude participation in exercise.

The above is a clinical trial exclusion criterion. Annotated with entity spans:
Patients with orthopedic or [Condition: neuromuscular disorders] that preclude participation in exercise.